Clinical trial exclusion criterion:
Concurrent malignancy (if in remission, at least 5 years disease free) except for localized (in-situ) disease, basal carcinomas and cutaneous squamous cell carcinomas that have been adequately treated

Entity relations:
- Has_temporal("malignancy", "Concurrent")
- Has_value("disease free", "at least 5 years")
- Has_qualifier("in remission", "disease free")
- Has_qualifier("malignancy", "in remission")
- Has_qualifier("localized (in-situ) disease", "adequately treated")
- Has_negation("localized (in-situ) disease", "except for")
- AND("malignancy", "localized (in-situ) disease")
- OR("localized (in-situ) disease", "basal carcinomas", "cutaneous squamous cell carcinomas")